Clinical trial exclusion criterion:
history of renal, hepatic, cardiac or pulmonary severe disease

Annotated entities:
- Condition: "pulmonary disease"
- Condition: "cardiac disease"
- Condition: "hepatic disease"
- Condition: "renal disease"
- Qualifier: "severe"